Clinical trial exclusion criterion:
Pregnant or breast-feeding subjects

Annotated entities:
- Condition: "Pregnant"
- Condition: "breast-feeding"